Clinical trial exclusion criterion:
Patients who had previously undergone operative therapy for the condition

Annotated entities:
- Competing_trial: "Patients who had previously undergone operative therapy for the condition"